Clinical trial inclusion criterion:
Female subjects of childbearing potential must agree to use highly effective birth control methods.

Annotated entities:
- Person: "Female"
- Condition: "childbearing potential"
- Procedure: "birth control methods"